What are the structures formed when keratin molecules come together?

Keratins form the intermediate filaments of the cytoskeleton and provide scaffold structures within cells.